Clinical trial exclusion criterion:
Use of psychostimulants, anti-depressants, neuroleptics or anti-convulsive agents within the past month.

Entity relations:
- Has_temporal("psychostimulants", "within the past month")
- OR("psychostimulants", "anti-depressants", "neuroleptics", "anti-convulsive agents")